Which are the drugs utilized for the burning mouth syndrome?

Dopaminergic drugs should be given in patients with BMS. 
Catuama reduces the symptoms of BMS and may be a novel therapeutic strategy for the treatment of this disease.
Capsaicin, alpha-lipoic acid (ALA), and clonazepam were those that showed more reduction in symptoms of BMS.
Treatment with placebos produced a response that was 72% as large as the response to active drugs